下列情況何者屬於較寬鬆的「無效醫療」定義？
A. 缺乏病理生理學依據的治療
B. 最大治療下病患仍然心跳停止
C. 在該病患身上已經失敗的治療
D. 有價值的治療目標無法被達成

正確答案：D. 有價值的治療目標無法被達成